Other clinically significant medical conditions that could interfere with the trial

The above is a clinical trial exclusion criterion. Annotated with entity spans:
[Non-query-able: Other clinically significant medical conditions that could interfere with the trial]